Clinical trial inclusion criteria:
Metabolic Syndrome (ATP III)
Moderate to severe OSA

Annotated entities:
- Condition: "Metabolic Syndrome"
- Measurement: "ATP"
- Value: "III"
- Qualifier: "Moderate to severe"
- Condition: "OSA"